Clinical trial inclusion criterion:
Patients with informed consents

Annotated entities:
- Informed_consent: "Patients with informed consents"